El piridoxal fosfato es un grupo prostético de las enzimas implicadas en reacciones de:
1. Acetilación.
2. Desulfatación.
3. Metilación.
4. Reducción.
5. Transaminación.

Respuesta correcta: 5. Transaminación.